Clinical trial exclusion criterion:
Subjects were not to have a postural drop of 20 mmHg or more in systolic blood pressure at screening.

Entity relations:
- Has_temporal("systolic blood pressure", "at screening")
- Has_value("systolic blood pressure", "postural drop of 20 mmHg")
- Has_negation("postural drop of 20 mmHg", "not")